Having participated in other clinical studies with dosing of investigational agents within 8 weeks prior to trial start or currently enrolled in an investigational study that includes treatment with medicinal agents. Subjects who are participating in observational studies or who are in a follow up period of a trial that included drug therapy may be considered for inclusion.

The above is a clinical trial exclusion criterion. Annotated with entity spans:
Having [Observation: participated in other clinical studies] with dosing of [Drug: investigational agents] [Temporal: within 8 weeks prior to trial start] or [Temporal: currently] [Observation: enrolled in an investigational study] that includes treatment with [Drug: medicinal agents]. [Non-representable: Subjects who are participating in observational studies or who are in a follow up period of a trial that included drug therapy may be considered for inclusion.]